Aged between 18 and 75

The above is a clinical trial inclusion criterion. Annotated with entity spans:
[Person: Aged] [Value: between 18 and 75]